Clinical trial inclusion criteria:
Age from birth to 21 years
All solid organ transplant recipients receiving their care at Seattle Children's Hospital
Signed consent, and when age appropriate, signed assent

Annotated entities:
- Value: "from birth to 21 years"
- Person: "Age"
- Visit: "Seattle Children's Hospital"
- Procedure: "solid organ transplant"
- Post-eligibility: "Signed consent, and when age appropriate, signed assent"